Dentro de la Escuela de Pensamiento de la Interacción, se incluye el modelo desarrollado por:
1. Faye Abdellah.
2. Callista Roy.
3. Dorothy Johnson.
4. Rosmarie Parse.
5. Hildegard Peplau.

Respuesta correcta: 5. Hildegard Peplau.